The patients have other cancers at the same time or have the history of other cancers except controlled skin basal cell carcinoma or skin squamous cell carcinoma or carcinoma in situ of cervix uterus;

The above is a clinical trial exclusion criterion. Annotated with entity spans:
The patients have [Condition: other cancers] [Temporal: at the same time] or have the history of [Condition: other cancers] [Negation: except] [Condition: controlled skin basal cell carcinoma] or [Condition: skin squamous cell carcinoma] or [Condition: carcinoma in situ of cervix uterus];